下列有關皮質醇對於體內能量物質之影響，何者正確？
A. 抑制糖質新生作用（gluconeogenesis）
B. 抑制脂肪分解（lipolysis）
C. 抑制酮生成（ketogenesis）
D. 促進脂肪分解

正確答案：D. 促進脂肪分解